Clinical trial exclusion criterion:
Patients using oral contraception.

Annotated entities:
- Procedure: "oral contraception"
- Drug: "oral contraception"